下列何者屬味覺皮質區？
A. 島葉（insula）
B. 枕葉（occipital lobe）
C. 內側額葉（medial frontal lobe）
D. 背外側額葉（dorsal lateral frontal lobe）

正確答案：A. 島葉（insula）